Clinical trial inclusion criterion:
BMI < 30

Annotated entities:
- Measurement: "BMI"
- Value: "< 30"